Abnormal liver enzymes (Aspartate transaminase (AST), Alanine transaminase (ALT), or alkaline phosphatase > 2.5 times the upper limit of normal)

The above is a clinical trial exclusion criterion. Annotated with entity spans:
[Value: Abnormal] [Measurement: liver enzymes] ([Measurement: Aspartate transaminase (AST)], [Measurement: Alanine transaminase (ALT)], or [Measurement: alkaline phosphatase] [Value: > 2.5 times the upper limit of normal])